Clinical trial inclusion criterion:
Patients must have a calculated serum creatinine clearance > 50 mL/min using Cockcroft-Gault calculation or based on 24-hour urine collection performed within 7 days prior to treatment.

Entity relations:
- Has_value("serum creatinine clearance", "> 50 mL/min")
- Has_index("within 7 days prior", "treatment")
- Has_qualifier("serum creatinine clearance", "Cockcroft-Gault calculation")
- Has_temporal("serum creatinine clearance", "within 7 days prior")
- OR("Cockcroft-Gault calculation", "24-hour urine collection")